一位 36 歲男性於劇烈運動後，又去吃完豐盛晚餐，爾後產生突發性四肢近端肌肉無力，送至急診就醫，發現血中鉀離子濃度下降至 1.8 mEq/L，下列何者為病患最可能之診斷？
A. 周期性麻痺（periodic paralysis）
B. 肌肉失養症（muscular dystrophy）
C. 重症肌無力症（myasthenia gravis）
D. 發炎性肌肉病變（inflammatory myopathy）

正確答案：A. 周期性麻痺（periodic paralysis）